Clinical trial inclusion criterion:
Willing to participate in research

Annotated entities:
- Observation: "participate in research"
- Mood: "Willing to"